Which is the molecular mechanism underlying K-ras alterations in carcinomas?

Activating point mutations most frequently in codon 12